Clinical trial exclusion criteria:
with centre neural system involvement
serious complications such as uncontrolled diabetes, gastric ulcer or other serious angiocardiopathy determined by the physician
HIV positive or active HBV infection or other uncontrolled systematic infection
clinical central nervous dysfunction
serious surgery within 30 days
pregnancy or baby nursing period or un-contracepted child bearing period woman.

Annotated entities:
- Condition: "centre neural system involvement"
- Condition: "diabetes"
- Qualifier: "uncontrolled"
- Condition: "complications"
- Qualifier: "serious"
- Condition: "gastric ulcer"
- Condition: "angiocardiopathy"
- Qualifier: "serious"
- Subjective_judgement: "determined by the physician"
- Condition: "HIV positive"
- Condition: "active HBV infection"
- Condition: "systematic infection"
- Qualifier: "uncontrolled"
- Condition: "central nervous dysfunction"
- Procedure: "surgery"
- Qualifier: "serious"
- Temporal: "within 30 days"
- Observation: "pregnancy"
- Observation: "baby nursing period"
- Negation: "un-"
- Procedure: "contracepted"
- Observation: "child bearing period"
- Person: "woman"